有關神經組織的組成細胞，下列敘述何項正確？
A. 蒲金氏細胞（Purkinje cell）位於大腦皮質區，負責協調肌肉活動
B. 脈絡叢細胞（cells of choroid plexus）具有纖毛（ciliated）
C. 中樞神經系統內，具有吞噬功能的是微小膠細胞（microglia）
D. 一個許旺氏細胞（Schwann cell）會包覆多條髓鞘軸突（myelinated axons）

正確答案：C. 中樞神經系統內，具有吞噬功能的是微小膠細胞（microglia）